下列何種病毒之基因體為 mRNA？
A. 流行性感冒病毒（Influenza virus）
B. 冠狀病毒（Coronavirus）
C. 腺病毒（Adenovirus）
D. 疱疹病毒（Herpesvirus）

正確答案：B. 冠狀病毒（Coronavirus）